Clinical trial exclusion criterion:
Use of prescription medications on a regular basis. The last use of any prescription medication must have been greater than 5 half-lives for the specific medication or at least 14 days prior to admission (Day -1), whichever is longer. Hormonal contraception is allowed for female subjects.

Annotated entities:
- Drug: "prescription medications"
- Drug: "any prescription medication"
- Temporal: "last use greater than 5 half-lives"
- Temporal: "at least 14 days prior to admission"
- Reference_point: "admission"
- Temporal: "regular basis"
- Grammar_Error: "is allowed"
- Procedure: "Hormonal contraception"
- Person: "female"